Schedule of procedures for the RELIANCE 4-Front Study (i.e. should not cause additional or missed visits);

The above is a clinical trial exclusion criterion. Annotated with entity spans:
[Context_Error: Schedule of procedures for the RELIANCE 4-Front Study (i.e. should not cause additional or missed visits);]